Meet criteria for schizophrenia, schizoaffective disorder, or another psychotic disorder based on structured clinical interview

The above is a clinical trial inclusion criterion. Annotated with entity spans:
Meet criteria for [Condition: schizophrenia], [Condition: schizoaffective disorder], or another [Condition: psychotic disorder] based on structured clinical interview